What is the role of the RUNX1-MYEF2 complex?

A novel complex, RUNX1-MYEF2, represses hematopoietic genes in erythroid cells.